Clinical trial inclusion criterion:
Subjects were to have a negative screen for HIV I and II, HBsAg, and antibody to Hepatitis C virus.

Entity relations:
- Has_value("screen for HIV II", "negative")
- Has_value("screen for HIV I", "negative")
- Has_value("HBsAg", "negative")
- Has_value("antibody to Hepatitis C virus", "negative")